一位三十歲德國麻疹抗體陰性的婦女，在懷孕第八週時，她的一歲半的小孩感染了德國麻疹，她既擔心自己得到德國麻疹，胎兒可能會有先天性德國麻疹，又不願意接受人工流產。在此情況下，該如何處理？
A. 施打活的德國麻疹疫苗（live rubella vaccine）
B. 施打減毒的活的德國麻疹疫苗（live attenuated rubella vaccine）
C. 施打不活性的德國麻疹疫苗（inactive rubella vaccine）
D. 施打人類免疫球蛋白（human immunoglobulin）

正確答案：D. 施打人類免疫球蛋白（human immunoglobulin）